Patients with serious complications (e.g., infection, hepatic encephalopathy, hepatorenal syndrome, gastrointestinal bleeding.)

The above is a clinical trial exclusion criterion. Annotated with entity spans:
Patients with [Qualifier: serious] [Condition: complications] (e.g., [Condition: infection], [Condition: hepatic encephalopathy], [Condition: hepatorenal syndrome], [Condition: gastrointestinal bleeding].)